Autoimmune corneal ulcer

The above is a clinical trial exclusion criterion. Annotated with entity spans:
[Qualifier: Autoimmune] [Condition: corneal ulcer]